Clinical trial exclusion criterion:
Chemotherapy or radiation within 3 weeks of the first scheduled study treatment.

Entity relations:
- Has_index("within 3 weeks of the first scheduled study treatment", "the first scheduled study treatment")
- Has_temporal("radiation", "within 3 weeks of the first scheduled study treatment")
- Has_temporal("Chemotherapy", "within 3 weeks of the first scheduled study treatment")
- OR("Chemotherapy", "radiation")